the residual limb must be stable in volume (no change in socket or socket padding in last 6 months) and without pain that limits function

The above is a clinical trial exclusion criterion. Annotated with entity spans:
[Non-query-able: the residual limb must be stable in volume (no change in socket or socket padding in last 6 months) and without pain that limits function]